Clinical trial exclusion criterion:
any neurological conditions other than PD;

Entity relations:
- Has_negation("PD", "other than")
- AND("neurological conditions", "PD")